Clinical trial inclusion criteria:
Apgar score at 5 minutes >7
birthweight greater than 2.4 kg
Age of at least 10 hours
At least one void.

Annotated entities:
- Measurement: "Apgar score"
- Value: ">7"
- Temporal: "at 5 minutes"
- Measurement: "birthweight"
- Value: "greater than 2.4 kg"
- Person: "Age"
- Value: "at least 10 hours"
- Multiplier: "At least one"
- Observation: "void"